Las neuronas piramidales están en:
1. Cerebelo.
2. Cerebro.
3. Médula espinal.
4. Ganglios raquídeos.
5. Hipófisis.

Respuesta correcta: 2. Cerebro.